Presumed AJCC (American Joint Committee on Cancer) tumor Stage I or II

The above is a clinical trial inclusion criterion. Annotated with entity spans:
Presumed [Measurement: AJCC] ([Measurement: American Joint Committee on Cancer]) tumor Stage [Value: I] or [Value: II]